Clinical trial exclusion criterion:
Presence of comorbidities that seriously affect the patient's safety or ability to complete the study, in the investigator's judgment;

Annotated entities:
- Non-query-able: "Presence of comorbidities that seriously affect the patient's safety or ability to complete the study, in the investigator's judgment;"